Clinical trial exclusion criterion:
Patients at risk for endovascular infection (previously documented rheumatic heart disease, congenital valve disease, surgically repaired congenital heart disease, unrepaired cyanotic congenital heart disease, any intracardiac repair with prosthetic material [mechanical or bio-prosthetic cardiac valves], previous or current endocarditis, permanent endovascular devices (e.g., endovascular grafts [e.g., aortic aneurysm repair, stents involving large arteries such as aorta, femorals and carotids], inferior vena cava filters, dialysis vascular grafts), tunnelled (not short-term) hemodialysis catheters, pacemakers or defibrillators. Patients with temporary central venous catheters, central venous dialysis catheters or peripherally inserted central catheters (PICCs) are not excluded and patients with coronary artery stents, coronary artery bypass grafts (CABG) or neurovascular coils are not excluded; patients with mitral valve prolapse or bicuspid aortic valve are not excluded providing they have no other exclusion criteria;

Entity relations:
- Has_qualifier("congenital heart disease", "surgically repaired")
- Has_qualifier("cyanotic congenital heart disease", "unrepaired")
- AND("intracardiac repair", "prosthetic material")
- Subsumes("prosthetic material", "mechanical cardiac valves")
- Has_qualifier("endovascular devices", "permanent")
- Has_qualifier("stents", "large arteries")
- Has_negation("mitral valve prolapse", "not")
- Has_negation("coronary artery stents", "not")
- Subsumes("peripherally inserted central catheters", "PICCs")
- Has_negation("central venous catheters", "not")
- Subsumes("endovascular devices", "endovascular grafts")
- Subsumes("risk for endovascular infection", "rheumatic heart disease")
- Subsumes("endovascular devices", "aortic aneurysm repair")
- Subsumes("risk for endovascular infection", "intracardiac repair")
- Subsumes("risk for endovascular infection", "endocarditis")
- OR("mechanical cardiac valves", "bio-prosthetic cardiac valves]")
- OR("mitral valve prolapse", "bicuspid aortic valve")
- OR("coronary artery stents", "coronary artery bypass grafts", "neurovascular coils")
- OR("central venous catheters", "central venous dialysis catheters", "peripherally inserted central catheters")
- OR("central venous catheters", "coronary artery stents", "mitral valve prolapse")
- OR("rheumatic heart disease", "hemodialysis catheters", "endovascular devices", "prosthetic material", "cyanotic congenital heart disease", "congenital heart disease", "congenital valve disease", "pacemakers")
- OR("aortic aneurysm repair", "stents")
- OR("endovascular grafts", "inferior vena cava filters", "dialysis vascular grafts")